La energía de activación de una reacción:
1. No se modifica por acción de las enzimas.
2. Es la energía necesaria para alcanzar el estado de transición.
3. Es inferior a la energía de los sustratos.
4. Es inferior a la energía de los productos.
5. Es una media del valor de ΔG de la reacción.

Respuesta correcta: 2. Es la energía necesaria para alcanzar el estado de transición.